一位第六頸脊髓完全損傷的 20 歲男性病患，其復健目標（rehabilitation goal）的設定，下列何者最難達成？
A. 穿戴輔具後可自行進食
B. 可自行操控電動輪椅
C. 使用腋下拐杖行走
D. 床與輪椅之間的轉位需部分協助

正確答案：C. 使用腋下拐杖行走